Clinical trial exclusion criterion:
Known prior stroke or TIA

Annotated entities:
- Condition: "stroke"
- Condition: "TIA"